Clinical trial exclusion criteria:
Blood donation of more than 450ml in the previous three months.
Subject with an abnormal karyotype in favor of Turner syndrome or having a premutation of the FMR1 gene or a syndromic form
Subject exclusion period in another study without direct individual benefit
Subject refusing to sign the consent form

Annotated entities:
- Procedure: "Blood donation"
- Qualifier: "of more than 450ml"
- Value: "more than 450ml"
- Temporal: "in the previous three months"
- Condition: "abnormal karyotype"
- Condition: "Turner syndrome"
- Condition: "premutation of the FMR1 gene"
- Condition: "syndromic form"
- Undefined_semantics: "syndromic form"
- Post-eligibility: "Subject exclusion period in another study without direct individual benefit"
- Context_Error: "Subject exclusion period in another study without direct individual benefit"
- Non-query-able: "Subject exclusion period in another study without direct individual benefit"
- Post-eligibility: "Subject refusing to sign the consent form"
- Non-query-able: "Subject refusing to sign the consent form"